Clinical trial inclusion criterion:
Has a life expectancy of >3 months

Annotated entities:
- Observation: "life expectancy"
- Value: ">3 months"